Clinical trial exclusion criterion:
Lack of consent

Annotated entities:
- Informed_consent: "Lack of consent"